Clinical trial exclusion criterion:
advanced chronic disease that would not allow the patient to complete the treatment or follow-up or attend visits

Annotated entities:
- Non-query-able: "dvanced chronic disease that would not allow the patient to complete the treatment or follow-up or attend visits"